Currently Homeless

The above is a clinical trial inclusion criterion. Annotated with entity spans:
Currently [Person: Homeless]